Las únicas fibras adrenérgicas autónomas son los axones de las neuronas:
1. Simpáticas preganglionares.
2. Simpáticas posganglionares.
3. Parasimpáticas preganglionares.
4. Parasimpáticas posganglionares.
5. Parasimpáticas ganglionares.

Respuesta correcta: 2. Simpáticas posganglionares.